List core circadian clock genes.

The core circadian clock genes are CLOCK, BMAL1, Per, and Cry.